Clinical trial exclusion criterion:
psychiatric conditions such as schizophrenia, adult ADHD, or bipolar disorder

Annotated entities:
- Condition: "psychiatric conditions"
- Condition: "schizophrenia"
- Condition: "adult ADHD"
- Condition: "bipolar disorder"